Clinical trial exclusion criterion:
diagnosed advanced heart, kidney or liver failure

Annotated entities:
- Condition: "advanced heart failure"
- Condition: "kidney failure"
- Condition: "liver failure"